Clinical trial exclusion criterion:
immunodepressed patients (bone marrow transplant patients, patients with severe neutropenia),

Entity relations:
- Subsumes("immunodepressed", "bone marrow transplant")
- OR("bone marrow transplant", "severe neutropenia")